A lower respiratory tract infection within 7 days of the screening visit.

The above is a clinical trial exclusion criterion. Annotated with entity spans:
A [Condition: lower respiratory tract infection] [Temporal: within 7 days of the screening visit].